El sistema vascular portal:
1. Son conexiones vasculares veno-venosas que drenan la sangre finalmente al corazón.
2. Se incluye en la circulación pulmonar.
3. Consiste en fístulas arterio-venosas.
4. Es el sistema linfático hepático.

Respuesta correcta: 1. Son conexiones vasculares veno-venosas que drenan la sangre finalmente al corazón.